Clinical trial inclusion criterion:
Participants must have at least one symptom per month in the month prior to enrollment

Entity relations:
- Has_multiplier("symptom", "at least one per month")
- Has_index("in the month prior to enrollment", "to enrollment")